消防局的救護車送來一位身分不明、意識不清的路倒病人，經檢查發現有顱內出血，神經外科王醫師判斷需要緊急開刀，但是要求一定要有人簽手術同意書他才開，王醫師說這是醫療法規定的，如果沒有同意書，即使病人不開刀立刻會死，他也不開，王醫師的說法對嗎？
A. 對，因為醫師要保護自己不會被告
B. 對，因為醫療法規定不論任何情況都要手術同意書
C. 不對，因為醫療法沒有規定手術需要同意書
D. 不對，因為醫療法雖然規定手術需要取得同意書，但情況緊急者，不在此限

正確答案：D. 不對，因為醫療法雖然規定手術需要取得同意書，但情況緊急者，不在此限